下列有關神經系統病變的敘述，何者錯誤？
A. 鉛（lead）可以損害末稍神經
B. 汞（mercury）可能引起中樞與周邊神經損傷
C. 砷（arsenic）中毒可能發生消化與神經系統的症狀
D. 紫質症（porphyria）與用藥無關

正確答案：D. 紫質症（porphyria）與用藥無關